What is 23andMe?

23andMe is a genetic testing company which offers personal genetic services.